Which protein does capmatinib bind?

Capmatinib binds MET.